Age of 18 and over, male or female;

The above is a clinical trial inclusion criterion. Annotated with entity spans:
[Person: Age] of [Value: 18 and over], [Person: male] or [Person: female];